Clinical trial inclusion criterion:
Diagnosed with spinal cord injury between 3 days and 4 weeks

Entity relations:
- Has_temporal("spinal cord injury", "between 3 days and 4 weeks")